Subjects who based on history or mental status examination have a significant risk of committing suicide, in the investigator's opinion.

The above is a clinical trial exclusion criterion. Annotated with entity spans:
Subjects who based on history or [Procedure: mental status examination] have a [Qualifier: significant] [Observation: risk of committing suicide], [Non-query-able: in the investigator's opinion].